Clinical trial exclusion criterion:
presence of ferrous-containing metals within the body (e.g., aneurysm clips, shrapnel/retained particles)

Annotated entities:
- Device: "ferrous-containing metals"
- Device: "aneurysm clips"
- Device: "shrapnel"
- Device: "retained particles"